Clinical trial exclusion criterion:
Subject with hypotension and a resting systolic blood pressure of < 90 mmHG or hypertension with a resting systolic blood pressure > 170 mmHG or a resting diastolic blood pressure > 110 mmHG

Entity relations:
- Has_value("systolic blood pressure", "< 90 mmHG")
- AND("hypotension", "systolic blood pressure")
- Has_value("systolic blood pressure", "> 170 mmHG")
- Has_value("diastolic blood pressure", "> 110 mmHG")
- AND("hypertension", "systolic blood pressure")
- OR("systolic blood pressure", "diastolic blood pressure")